Qualifies for prostaglandin administration according to current Parkland protocol

The above is a clinical trial inclusion criterion. Annotated with entity spans:
Qualifies for [Procedure: prostaglandin administration] according to current [Procedure: Parkland protocol]